Contra-indications to muscle relaxants: 1) Concurrent use of centrally acting opioids; 2) Renal impairment; 3) Liver abnormality including cirrhosis or elevated enzymes 4) Use of any of the following medications: fluvoxamine, fluoroquinolones, amiodarone, mexiletine, propafenone, verapamil, cimetidine, famotidine, acyclovir, ticlopidine, oral contraceptive pills

The above is a clinical trial exclusion criterion. Annotated with entity spans:
[Condition: Contra-indications] to [Drug: muscle relaxants]: 1) [Temporal: Concurrent] use of [Drug: centrally acting opioids]; 2) [Condition: Renal impairment]; 3) [Condition: Liver abnormality] including [Condition: cirrhosis] or [Condition: elevated enzymes] 4) Use of any of the following medications: [Drug: fluvoxamine], [Drug: fluoroquinolones], [Drug: amiodarone], [Drug: mexiletine], [Drug: propafenone], [Drug: verapamil], [Drug: cimetidine], [Drug: famotidine], [Drug: acyclovir], [Drug: ticlopidine], [Drug: oral contraceptive pills]